Clinical trial exclusion criterion:
Self reported current or chronic narcotic use (typical daily use)

Entity relations:
- Has_temporal("narcotic use", "current")
- Has_qualifier("narcotic use", "Self reported")
- Has_multiplier("narcotic use", "daily use")
- OR("current", "chronic")